Clinical trial exclusion criterion:
2. Screening tools: TMS adult safety screening.

Entity relations:
- Subsumes("Screening", "TMS adult safety screening")